La idea delirante corporal se define como:
1. Idea delirante cuyo contenido principal se refiere al funcionamiento del propio cuerpo.
2. Idea delirante de que el sujeto ha perdido o perderá todas o casi todas sus posesiones físicas.
3. Ideal delirante en la que los sentimientos, impulsos, pensamientos o actos son vividos como si no fuesen propios y estuviesen impuestos por alguna fuerza externa.
4. Idea delirante cuyo contenido implica una exagerada valoración de la importancia, el poder, el conocimiento o la identidad personales.
5. Idea delirante en torno a la no existencia del yo.

Respuesta correcta: 1. Idea delirante cuyo contenido principal se refiere al funcionamiento del propio cuerpo.